Clinical trial exclusion criteria:
Meets criteria for Major Depressive Episode, by Diagnostic Statistical Manual of Mental Disorder - IV (TR) criteria
Clinically significant agitation /aggression for which either 1) the frequency of agitation /aggression as assessed by the NPI is 'Very frequently', or 2) the frequency of agitation /aggression as assessed by the NPI is 'Frequently' AND the severity of the agitation as assessed by the NPI is 'Moderate', or 'Marked'
Clinically significant delusions for which either 1) the frequency of delusions as assessed by the NPI is 'Very frequently', or 2) the frequency of delusions as assessed by the NPI is 'Frequently' AND the severity of the delusions as assessed by the NPI is 'Moderate', or 'Marked'
Clinically significant hallucinations for which either 1) the frequency of hallucinations as assessed by the NPI is 'Very frequently', or 2) the frequency of hallucinations as assessed by the NPI is 'Frequently' AND the severity of the hallucinations as assessed by the NPI is 'Moderate', or 'Marked'
Treatment with psychotropic medications in the 2 weeks prior to randomization with the exception of approved treatments for dementia (ChEIs and memantine), selective serotonin reuptake inhibitor antidepressants, and trazodone (if used as an aid to facilitate sleep and not as an antidepressant); other psychotropics (with the exclusion of antipsychotics), if stable for 3 months, may be allowed only with Steering Committee approval on a case by case basis. Note that antipsychotics are expressly prohibited.
Treatment with methylphenidate is contraindicated in the opinion of the study physician
Failure of treatment with methylphenidate in the past for apathy after convincing evidence of an adequate trial as judged by study physician
Treatment with a medication that would prohibit the safe concurrent use of methylphenidate such as monoamine oxidase inhibitors and tricyclic antidepressants
Need for acute psychiatric hospitalization or is suicidal
Uncontrolled hypertension (medication non-compliance or past 3 months with a diastolic reading of 105 as verified by compartment pressure of the rectus sheath (CPRS))
Symptomatic coronary artery disease deemed to be significant by study physician at the time of screening
Lack of appetite that results in significant unintentional weight loss as determined by the study physician in the last three months
Significant communicative impairments
Current participation in a clinical trial or in any study that may add significant burden or affect study outcomes
Hyperthyroidism, advanced arteriosclerosis, symptomatic cardiovascular disease, serious structural cardiac abnormalities, cardiomyopathy, serious heart rhythm abnormalities, or a family history of sudden death or death related to heart problems
Glaucoma, pheochromocytoma, or known or suspected hypersensitivity to methylphenidate or its excipients
Central Nervous System (CNS) abnormalities (e.g., cerebral aneurysm) and/or other vascular abnormalities such as vasculitis or pre-existing stroke, motor tics or a family history or diagnosis of Tourette's syndrome, seizures (convulsions, epilepsy), or abnormal EEGs
Any condition that, in the opinion of the study physician, makes it medically inappropriate or risky for the patient to enroll in the trial

Annotated entities:
- Condition: "Major Depressive Episode"
- Measurement: "Diagnostic Statistical Manual of Mental Disorder - IV (TR) criteria"
- Value: "Meets"
- Condition: "agitation /aggression"
- Qualifier: "Clinically significant"
- Undefined_semantics: "Clinically significant"
- Multiplier: "frequency of agitation /aggression"
- Condition: "agitation /aggression"
- Measurement: "NPI"
- Value: "Very frequently"
- Multiplier: "frequency of agitation /aggression"
- Condition: "agitation /aggression"
- Measurement: "NPI"
- Value: "Frequently"
- Measurement: "NPI"
- Value: "Moderate"
- Value: "Marked"
- Qualifier: "severity of the agitation"
- Condition: "agitation"
- Condition: "delusions"
- Qualifier: "Clinically significant"
- Multiplier: "frequency of delusions"
- Condition: "delusions"
- Measurement: "NPI"
- Value: "Very frequently"
- Multiplier: "frequency of delusions"
- Condition: "delusions"
- Measurement: "NPI"
- Value: "Frequently"
- Qualifier: "severity of the delusions"
- Condition: "delusions"
- Measurement: "NPI"
- Value: "Moderate"
- Value: "Marked"
- Condition: "hallucinations"
- Qualifier: "Clinically significant"
- Multiplier: "frequency of hallucinations"
- Condition: "hallucinations"
- Measurement: "NPI"
- Value: "Very frequently"
- Multiplier: "frequency of hallucinations"
- Condition: "hallucinations"
- Measurement: "NPI"
- Value: "Frequently"
- Qualifier: "severity of the hallucinations"
- Condition: "hallucinations"
- Measurement: "NPI"
- Value: "Moderate"
- Value: "Marked"
- Drug: "psychotropic medications"
- Temporal: "in the 2 weeks prior to randomization"
- Reference_point: "randomization"
- Condition: "dementia"
- Procedure: "treatments for dementia"
- Drug: "ChEIs"
- Drug: "memantine"
- Drug: "selective serotonin reuptake inhibitor antidepressants"
- Drug: "trazodone"
- Negation: "with the exception of"
- Context_Error: "(if used as an aid to facilitate sleep and not as an antidepressant)"
- Drug: "other psychotropics"
- Drug: "antipsychotics"
- Negation: "with the exclusion of"
- Qualifier: "stable"
- Temporal: "for 3 months"
- Drug: "methylphenidate"
- Drug: "methylphenidate"
- Subjective_judgement: "as judged by study physician"
- Drug: "medication that would prohibit the safe concurrent use of methylphenidate"
- Drug: "methylphenidate"
- Temporal: "concurrent"
- Observation: "prohibit"
- Drug: "monoamine oxidase inhibitors"
- Drug: "tricyclic antidepressants"
- Procedure: "psychiatric hospitalization"
- Observation: "Need for"
- Temporal: "acute"
- Condition: "suicidal"
- Condition: "Uncontrolled hypertension"
- Qualifier: "Uncontrolled"
- Condition: "medication non-compliance"
- Temporal: "past 3 months"
- Measurement: "diastolic reading"
- Value: "105"
- Context_Error: "diastolic reading"
- Measurement: "compartment pressure of the rectus sheath (CPRS)"
- Qualifier: "as verified by compartment pressure of the rectus sheath (CPRS)"
- Condition: "coronary artery disease"
- Qualifier: "Symptomatic"
- Temporal: "at the time of screening"
- Reference_point: "time of screening"
- Condition: "unintentional weight loss"
- Qualifier: "significant"
- Undefined_semantics: "significant"
- Condition: "Lack of appetite"
- Qualifier: "as determined by the study physician"
- Temporal: "in the last three months"
- Qualifier: "Significant"
- Undefined_semantics: "Significant"
- Condition: "communicative impairments"
- Undefined_semantics: "communicative impairments"
- Post-eligibility: "Current participation in a clinical trial or in any study that may add significant burden or affect study outcomes"
- Condition: "Hyperthyroidism"
- Condition: "arteriosclerosis"
- Qualifier: "advanced"
- Condition: "cardiovascular disease"
- Qualifier: "symptomatic"
- Qualifier: "serious"
- Condition: "structural cardiac abnormalities"
- Condition: "cardiomyopathy"
- Condition: "heart rhythm abnormalities"
- Qualifier: "serious"
- Observation: "family history"
- Condition: "sudden death"
- Condition: "death related to heart problems"
- Qualifier: "related to heart problems"
- Condition: "Glaucoma"
- Condition: "pheochromocytoma"
- Condition: "hypersensitivity"
- Drug: "methylphenidate or its excipients"
- Drug: "its excipients"
- Observation: "suspected"
- Observation: "known"
- Condition: "Central Nervous System (CNS) abnormalities"
- Condition: "cerebral aneurysm"
- Condition: "vascular abnormalities"
- Condition: "vasculitis"
- Condition: "stroke"
- Temporal: "pre-existing"
- Condition: "motor tics"
- Observation: "family history"
- Condition: "Tourette's syndrome"
- Condition: "seizures"
- Condition: "convulsions"
- Observation: "diagnosis"
- Condition: "epilepsy"
- Qualifier: "abnormal"
- Condition: "EEGs"
- Post-eligibility: "Any condition that, in the opinion of the study physician, makes it medically inappropriate or risky for the patient to enroll in the trial"